Children aged 3-16 with a parent/guardian (hereafter termed parent) reported history of allergy to a penicillin antibiotic in which the reported allergic reaction occurred at least six months prior to the current PED visit.

The above is a clinical trial inclusion criterion. Annotated with entity spans:
[Person: Children] [Person: aged] [Value: 3-16] with a parent/guardian (hereafter termed parent) reported history of [Condition: allergy] to a [Drug: penicillin antibiotic] in which the reported [Condition: allergic reaction] occurred [Temporal: at least six months prior to the current PED visit].